Hemoglobin A1c (HbA1c) = 9%

The above is a clinical trial inclusion criterion. Annotated with entity spans:
[Measurement: Hemoglobin A1c (HbA1c)] [Value: = 9%]